FEV1/SVC <70% of predicted value post bronchodilator (SVC is slow VC) and FEV1 < 80% of predicted value post-bronchodilator

The above is a clinical trial inclusion criterion. Annotated with entity spans:
[Measurement: FEV1/SVC] [Value: <70% of predicted value] [Qualifier: post bronchodilator] (SVC is slow VC) and [Measurement: FEV1] [Value: < 80% of predicted value] [Qualifier: post-bronchodilator]